Clinical trial exclusion criterion:
Refusal to sign an informed consent form to participate in this study, and sign the hospital information release form, if applicable

Annotated entities:
- Informed_consent: "sign an informed consent form"
- Observation: "Refusal to"
- Informed_consent: "sign the hospital information release form"